Clinical trial inclusion criterion:
planned to undergo PCI recently

Annotated entities:
- Mood: "planned to undergo"
- Procedure: "PCI"
- Temporal: "recently"